Documented written informed consent.

The above is a clinical trial inclusion criterion. Annotated with entity spans:
Documented [Observation: written informed consent].